林先生 36 歲，罹患急性骨髓性白血病，在化學治療後成功達到完全緩解狀態，在醫師建議下接受異體造血幹細胞移植。以下何種檢驗其可靠性及時效最能證實移植成功？
A. RBCs ABO grouping
B. DNA/STR（short tandem repeat）analysis
C. chromosomal study
D. RH system

正確答案：B. DNA/STR（short tandem repeat）analysis